Clinical trial inclusion criterion:
Serum ferritin =500 ng/mL and transferrin saturation (TSAT) =25%

Annotated entities:
- Measurement: "Serum ferritin"
- Value: "=500 ng/mL"
- Measurement: "transferrin saturation"
- Measurement: "TSAT"
- Value: "=25%"